Clinical trial exclusion criterion:
Ocular surface or annexes metaplastic lesions

Annotated entities:
- Condition: "lesions Ocular surface"
- Condition: "annexes metaplastic lesions Ocular"